Clinical trial inclusion criterion:
Technical possibility to obtain a new tissue biopsy to determine stathmin level in the tumour recurrence.

Annotated entities:
- Procedure: "tissue biopsy"
- Mood: "Technical possibility to obtain"
- Condition: "tumour recurrence"